Clinical trial inclusion criterion:
willingness to perform home glucose monitoring

Annotated entities:
- Non-query-able: "willingness to perform home glucose monitoring"